LINC00339 is a diagnostic, prognostic and treatment efficacy biomarker for what disease?

LINC00339 as a cancer diagnostic, prognostic and treatment efficacy biomarker.